Clinical trial inclusion criterion:
Patients after throat surgeries: tonsillectomy, adenotonsillectomy, uvulopalatoplasty, uvulopalatopharyngoplasty

Entity relations:
- Subsumes("throat surgeries", "tonsillectomy")
- Subsumes("throat surgeries", "adenotonsillectomy")
- Subsumes("throat surgeries", "uvulopalatoplasty")
- Subsumes("throat surgeries", "uvulopalatopharyngoplasty")